Which cytokine molecule activates SMADs?

SMADs are activated by Transforming growth factor beta (TGF beta).